Clinical trial exclusion criterion:
The patients have history of neoadjuvant hormone therapy.

Annotated entities:
- Procedure: "neoadjuvant hormone therapy"